What is a HapMap

The "HapMap" project is now underway to characterize patterns of LD in the human genome.